Participation in another clinical trial within the 30 days prior to randomization.

The above is a clinical trial exclusion criterion. Annotated with entity spans:
[Non-query-able: Participation in another clinical trial within the 30 days prior to randomization.]